Clinical trial exclusion criterion:
creatinine clearance less than 30 ml/min

Annotated entities:
- Measurement: "creatinine clearance"
- Value: "less than 30 ml/min"